一位 38 歲男性病人主訴倦怠、茶色尿，血液檢查顯示：ALT（GPT）：836 U/L（正常值＜40 U/L）、 AST（GOT）：578 U/L（正常值＜45 U/L）、bilirubin（total/direct）：3.8/2.5 mg/dL，HBsAg：陰性、 HBeAg：陽性、HBV DNA：3,850,000 copies/mL。病人過去未曾服用任何抗病毒藥物治療。請問下列何種藥物不宜使用於此病人？
A. lamivudine
B. telbivudine
C. entecavir
D. pegylated interferon

正確答案：D. pegylated interferon